icterus

The above is a clinical trial exclusion criterion. Annotated with entity spans:
[Condition: icterus]